Clinical trial exclusion criterion:
Radiotherapy within 4 weeks of trial entry.

Entity relations:
- Has_index("within 4 weeks of trial entry", "trial entry")
- Has_temporal("Radiotherapy", "within 4 weeks of trial entry")